Abdominal ultrasound display the contractibility of gallbladder is poor.

The above is a clinical trial exclusion criterion. Annotated with entity spans:
[Procedure: Abdominal ultrasound] display the [Measurement: contractibility of gallbladder] is [Value: poor].